Clinical trial exclusion criterion:
The current OCD symptoms are too severe that the patient cannot finish the evaluation or receive the ERP

Entity relations:
- Has_qualifier("OCD symptoms", "severe")